allergy to artemisinin drugs

The above is a clinical trial exclusion criterion. Annotated with entity spans:
[Condition: allergy] to [Drug: artemisinin drugs]